Clinical trial inclusion criterion:
Receptors of a first kidney transplant from an incompatible HLA living donor (at least 1 mismatch HLA at any antigenic level).

Annotated entities:
- Procedure: "first kidney transplant"
- Qualifier: "incompatible HLA"
- Qualifier: "living donor"
- Multiplier: "at least 1"
- Observation: "mismatch HLA"